Chronic kidney disease with estimated Glomerular Filtration Rate < 30 ml/min/1.73 m2,

The above is a clinical trial exclusion criterion. Annotated with entity spans:
[Condition: Chronic kidney disease] with [Measurement: estimated Glomerular Filtration Rate] [Value: < 30 ml/min/1.73 m2],